Which are the best methods for the prediction of circular RNA (circRNA)?

PcircRNAfinder : a software for circRNA prediction in plants. A circRNA expression from RNA sequencing  here, we use common RNAseq datasets to scrutinize and compare the output from five different algorithms; circRNAfinder, findcirc, CIRCexplorer, CIRI, and MapSplice and evaluate the levels of bona fide and false positive circRNAs based on RNase R resistance. Numerous algorithms that are used to detect genome-wide circRNA prediction software for plants  was developed in the past few years, but there is little overlap in their predictions and no clear gold-standard method to assess the accuracy of these algorithms. We developed the software tandem, DCC and CircTest DCC uses output from the STAR read mapper to systematically detect circRNAs in total RNA-seq data. MiARma-Seq : a comprehensive tool for miRNA, mRNA and circRNA analysis. Circular RNA profile in gliomas revealed by identification tool UROBORUS.